Clinical trial exclusion criterion:
Fasting plasma glucose > 7,0 mM, HbA1c > 48 mmol/mol 3 months after RYGB

Annotated entities:
- Measurement: "Fasting plasma glucose"
- Value: "> 7,0 mM"
- Measurement: "HbA1c"
- Value: "> 48 mmol/mol"
- Temporal: "3 months after RYGB"